慢性胰臟炎最常見的原因為何？
A. 膽結石
B. 長期	酒
C. 慢性肝炎
D. CFTR基因突變

正確答案：B. 長期	酒